下列有關人體細胞進行葡萄糖新生作用（gluconeogenesis）之敍述何者正確？
A. 可將蛋白質轉變成血糖
B. 胰島素可活化葡萄糖新生作用
C. 攝取高醣類食物後，利用此作用來降低血糖
D. 脂肪酸轉變成葡萄糖之必需途徑

正確答案：A. 可將蛋白質轉變成血糖